Clinical trial inclusion criterion:
Documentation of the presence of an acute pulmonary exacerbation, based on CF Foundation guidelines, as diagnosed by a faculty member of the Denver Adult CF Program.

Annotated entities:
- Condition: "acute pulmonary exacerbation"
- Measurement: "CF Foundation guidelines"
- Non-query-able: "as diagnosed by a faculty member of the Denver Adult CF Program"